Clinical trial inclusion criterion:
presents with signs and symptoms of a SSTI

Entity relations:
- AND("signs", "SSTI")
- OR("signs", "symptoms")